Current use of high dose inhaled or systemic steroids

The above is a clinical trial exclusion criterion. Annotated with entity spans:
[Temporal: Current] use of [Qualifier: high dose] [Qualifier: inhaled] or [Qualifier: systemic] [Drug: steroids]